What is BEL(Biological Expression Language) used for?

Biological Expression Language (BEL) is a novel method for the automatic extraction of causal relation networks from biomedical literature.